一位30歲臺灣人左手發生深層靜脈血栓 （deep vein thrombosis，DVT），回顧其家族史，他的哥哥在35歲時死於肺栓塞。下列何者最不可能是這位病人DVT發生的原因？
A. protein C deficiency
B. protein S deficiency
C. antithrombin III deficiency
D. factor V Leiden mutation

正確答案：D. factor V Leiden mutation